Clinical trial inclusion criterion:
Patient's written informed consent. Adequate cognitive capacity.

Annotated entities:
- Post-eligibility: "Patient's written informed consent. Adequate cognitive capacity"